真菌細胞壁特有的成分是：
A. 麥角醇
B. 幾丁質
C. 角質
D. 醣苷類

正確答案：B. 幾丁質